Hyper sensibility to sirolimus formula;

The above is a clinical trial exclusion criterion. Annotated with entity spans:
[Condition: Hyper sensibility] to [Drug: sirolimus] formula;